Clinical trial inclusion criterion:
History of three or more consecutively failed In Vitro Fertilization (IVF) cycles after embryo transfer.

Annotated entities:
- Multiplier: "three or more"
- Qualifier: "consecutively failed"
- Procedure: "In Vitro Fertilization"
- Procedure: "IVF"
- Temporal: "after embryo transfer"
- Reference_point: "embryo transfer"